Pre-existing renal or hepatic failure

The above is a clinical trial exclusion criterion. Annotated with entity spans:
[Temporal: Pre-existing] [Condition: renal] or [Condition: hepatic failure]